Clinical trial exclusion criterion:
Patients having received any other investigational product within recent 12 weeks

Entity relations:
- Has_temporal("other investigational product", "within recent 12 weeks")